Clinical trial exclusion criterion:
Pterygium, pinguecula, or corneal scars within the visual axis

Annotated entities:
- Condition: "Pterygium"
- Condition: "pinguecula"
- Condition: "corneal scars"
- Qualifier: "within the visual axis"